Anticoagulation

The above is a clinical trial exclusion criterion. Annotated with entity spans:
[Procedure: Anticoagulation]